Clinical trial inclusion criterion:
Elevated fasting glucose (=100 mg/dl), or on medication for treating the condition

Annotated entities:
- Value: "Elevated"
- Measurement: "fasting glucose"
- Value: "=100 mg/dl"
- Condition: "Elevated fasting glucose"
- Drug: "medication for treating"